Clinical trial exclusion criteria:
Patients incapable to understanding and will;
Patients participating in previous, concurrent or not, trials (ongoing or completed within three months);
Patients surgically treated for the same defect within one year;
Patients affected by malignancy;
Patients affected by metabolic or thyroid disorders;
Patients used to alcohol or drug (medication) abuse;
Patients affected by synovitis;
Varus or valgus misalignment exceeding 15°;
Body Mass Index > 40;
Patients with trauma within 6 months pre-operative.

Annotated entities:
- Observation: "incapable to understanding"
- Observation: "will incapable to"
- Temporal: "previous"
- Observation: "trials participating in"
- Qualifier: "ongoing"
- Qualifier: "completed"
- Temporal: "within three months"
- Procedure: "surgically treated"
- Condition: "the same defect"
- Temporal: "within one year"
- Condition: "malignancy"
- Condition: "metabolic disorders"
- Condition: "thyroid disorders"
- Condition: "alcohol abuse"
- Condition: "drug abuse"
- Condition: "medication abuse"
- Condition: "synovitis"
- Condition: "valgus misalignment"
- Condition: "Varus misalignment"
- Measurement: "valgus misalignment"
- Measurement: "Varus misalignment"
- Value: "exceeding 15°"
- Measurement: "Body Mass Index"
- Value: "> 40"
- Procedure: "trauma"
- Temporal: "within 6 months pre-operative"
- Reference_point: "pre-operative"
- Procedure: "operative"